Current DVT

The above is a clinical trial exclusion criterion. Annotated with entity spans:
[Temporal: Current] [Procedure: DVT]